Clinical trial exclusion criterion:
Current known infection with human immunodeficiency virus (HIV), active hepatitis B and/or hepatitis C virus.

Entity relations:
- Has_temporal("human immunodeficiency virus (HIV)", "Current")
- OR("human immunodeficiency virus (HIV)", "hepatitis C virus", "hepatitis B virus")